List disorders that are caused by mutations in the mitochondrial MTND6 gene.

Mitochondrial MTND6 gene mutations are the cause of Leigh syndrome and Leber's hereditary optic neuropathy and/or dystonia.